52歲男性，主訴反覆出現之左臉陣發性劇烈疼痛一年多，在發作數週或數月後，可自行緩解數月。疼痛部位大多在左臉中下部分，無感覺缺失。其最可能診斷為下列何者？
A. 中腦（midbrain）中風
B. 三叉神經痛（trigeminal neuralgia）
C. 舌咽神經痛（glossopharyngeal neuralgia）
D. 癲癇發作（seizures）

正確答案：B. 三叉神經痛（trigeminal neuralgia）